Clinical trial inclusion criterion:
Having been diagnosed with primary OCD as defined by the Diagnostic and Statistical Manual of Mental Disorders (DSM-IV-) criteria;Cleaning or checking as primary OCD symptoms

Annotated entities:
- Condition: "primary OCD"
- Measurement: "DSM-IV"
- Measurement: "Diagnostic and Statistical Manual of Mental Disorders"